Which aminoacid position in the human CREB protein is phosphorylated?

pCREB is phosphorylated at its Serine 133.